有微絲蟲血症（microfilaremia）但沒有臨床症狀的班氏絲蟲（Wuchereria bancrofti）病患，下列敘述那些錯誤？①通常抗絲蟲抗體之效價很高 ②因抗體抑制微絲蟲活性而減少症狀發生 ③沒有症狀故無需用藥治療
A. 僅①②
B. 僅①③
C. 僅②③
D. ①②③

正確答案：D. ①②③